Clinical trial inclusion criterion:
Patient aged 18 ans or more

Entity relations:
- Has_value("aged", "18 ans or more")